Las bases nitrogenadas alteradas o minoritarias:
1. No se detectan en el ADN.
2. No se detectan en el ARN.
3. Protegen la información genética.
4. No se detectan en el tARN.
5. No son capaces de aparearse.

Respuesta correcta: 3. Protegen la información genética.